Clinical trial exclusion criterion:
Had a nontuberculous mycobacterial infection or opportunistic infection within 6 months prior to Screening

Annotated entities:
- Condition: "nontuberculous mycobacterial infection"
- Condition: "opportunistic infection"
- Temporal: "within 6 months prior to Screening"